Clinical trial exclusion criterion:
Needs for co-administration of non-study antihypertensive agents or contraindicated medications during the study

Entity relations:
- Has_qualifier("antihypertensive agents", "non-study")
- Has_temporal("antihypertensive agents", "co-administration during the study")
- Has_temporal("contraindicated medications", "co-administration during the study")
- OR("antihypertensive agents", "contraindicated medications")